Age under 18 years old or greater than 75 years old

The above is a clinical trial exclusion criterion. Annotated with entity spans:
[Person: Age] [Value: under 18 years old or greater than 75 years old]